Clinical trial exclusion criterion:
Invasive knee treatments with hyaluronic acid infusion, corticosteroids and anaesthetics, in the target knee, up to 6 months previous to study inclusion.

Entity relations:
- Has_index("up to 6 months previous", "study inclusion")
- Has_index("Invasive knee treatments", "target knee")
- Has_temporal("Invasive knee treatments", "up to 6 months previous")
- Has_index("hyaluronic acid", "target knee")
- Has_index("hyaluronic acid infusion", "target knee")
- Has_index("corticosteroids", "target knee")
- Has_index("anaesthetics", "target knee")
- Has_temporal("hyaluronic acid", "up to 6 months previous")
- Has_temporal("hyaluronic acid infusion", "up to 6 months previous")
- Has_temporal("corticosteroids", "up to 6 months previous")
- Has_temporal("anaesthetics", "up to 6 months previous")